Which effects create neighborhoods of transcriptional regulation in eukaryotes?

we propose that enhancer sharing is commonplace among eukaryotes, and that ep distance is an important layer of information in gene regulation.